24 歲女性有難控制的高血壓，從二年前診斷之後就不斷增加使用的藥物與劑量，目前使用藥品包括 labetalol 1000 mg bid，lisinopril 40 mg qd，clonidine 0.1 mg bid，amlodipine 5 mg qd。身體診查：血壓 mmHg，心跳每分鐘 84 次，沒有呼吸窘迫，心臟檢查沒有心雜音或心摩擦音。週邊動脈脈搏對稱且正常，四肢沒有水腫，沒有多毛，無脂肪異常分布或生殖器異常。實驗室檢查：鉀 2.8 mEg/dL，空腹血糖值 114 mg/dL，若依上述情況，最可能的診斷是：
A. 嗜鉻細胞瘤（pheochromocytoma）
B. 庫欣氏症（Cushing's syndrome）
C. 先天性腎上腺增生（congenital adrenal hyperplasia）
D. 康氏症（Conn's syndrome）

正確答案：D. 康氏症（Conn's syndrome）